Hemoglobin <9 g/dL

The above is a clinical trial exclusion criterion. Annotated with entity spans:
[Measurement: Hemoglobin] [Value: <9 g/dL]